Clinical trial exclusion criterion:
Slit lamp findings that would contraindicate contact lens wear such as:

Entity relations:
- Has_value("Slit lamp", "findings")
- AND("Slit lamp", "contraindicate contact lens")